Clinical trial inclusion criterion:
The patients have normal cardiac functions by echocardiography.

Annotated entities:
- Condition: "normal cardiac functions"
- Procedure: "echocardiography"